Clinical trial inclusion criterion:
Age of at least 10 hours

Annotated entities:
- Person: "Age"
- Value: "at least 10 hours"